Clinical trial exclusion criterion:
Life expectancy <1 year due to comorbidity

Annotated entities:
- Observation: "Life expectancy"
- Value: "<1 year"
- Condition: "comorbidity"